關於環狀軟骨壓迫法（cricoid pressure, Sellick's maneuver），下列敘述何者正確？
A. 除了壓迫環狀軟骨外，若壓迫甲狀軟骨亦可達到同樣的目的
B. 只有氣管插管當時才可使用 cricoid pressure，bag-mask ventilation 時不可使用
C. 此方法可完全避免胃食道逆流及吸入性肺炎
D. 病人處於非空腹（full stomach）狀態時，必須使用環狀軟骨壓迫法

正確答案：D. 病人處於非空腹（full stomach）狀態時，必須使用環狀軟骨壓迫法